Clinical trial exclusion criterion:
Comorbid major depressive disorder diagnosis which predates OCD diagnosis

Annotated entities:
- Condition: "major depressive disorder"
- Qualifier: "Comorbid"
- Temporal: "predates OCD diagnosis"
- Reference_point: "OCD diagnosis"